Clinical trial exclusion criterion:
Immunosuppressive therapy before 6 months of study initiation

Annotated entities:
- Procedure: "Immunosuppressive therapy"
- Temporal: "before 6 months of study initiation"
- Reference_point: "study initiation"